CICC placed in the internal jugular vein or subclavian vein position

The above is a clinical trial inclusion criterion. Annotated with entity spans:
[Device: CICC placed] [Qualifier: in the internal jugular vein] or subclavian vein position